Advanced heart block or sinus node dysfunction

The above is a clinical trial exclusion criterion. Annotated with entity spans:
[Qualifier: Advanced] [Condition: heart block] or [Condition: sinus node dysfunction]